Blind patients

The above is a clinical trial exclusion criterion. Annotated with entity spans:
[Condition: Blind] patients